Clinical trial exclusion criterion:
Body mass index greater than 40 kg / m2

Entity relations:
- Has_value("Body mass index", "greater than 40 kg / m2")